所謂 Caroli's disease 指的是：
A. choledochal cyst, typeⅠ
B. choledochal cyst, typeⅢ
C. choledochal cyst, type Ⅳ
D. choledochal cyst, typeⅤ

正確答案：D. choledochal cyst, typeⅤ